Clinical trial exclusion criteria:
Women of child-bearing potential, who are biologically able to conceive, not employing two forms of highly effective contraception or who are pregnant.
Women who are breast-feeding
Fertile males unwilling to use contraception
Patients with brain metastases or any history of brain metastases
Patients who have undergone major surgery (e.g., intra-thoracic, -abdominal, or -pelvic) </= 4 weeks prior to starting study treatment or who have not recovered from such therapy
Patients with a history of pulmonary embolism, or untreated deep vein thrombosis within the past 6 months
Impairment of gastrointestinal (GI) function or GI disease that may significantly alter the absorption of dovitinib
The subject has had another active malignancy within the past 5 years except for cervical cancer in situ, in situ carcinoma of the bladder or non-melanoma carcinoma of the skin.
Patients who have received the last administration of an anticancer therapy including chemotherapy, immunotherapy, hormonal therapy and monoclonal antibodies </= 2 weeks prior to starting the study drug, or who have not recovered from the side effects of such therapy
Cirrhosis, chronic active hepatitis or chronic persistent hepatitis
Patients who are currently receiving prasugrel
No concurrent use of isoniazid, labetolol, trovafloxacin, tolcapone, and felbamate
No concurrent use of other investigational drugs or antineoplastic therapies.
Patients with impaired cardiac function or clinically significant cardiac diseases.

Annotated entities:
- Person: "Women"
- Condition: "child-bearing potential"
- Condition: "biologically able to conceive"
- Multiplier: "two"
- Device: "highly effective contraception"
- Condition: "pregnant"
- Negation: "not"
- Person: "Women"
- Condition: "breast-feeding"
- Person: "males"
- Condition: "Fertile"
- Observation: "unwilling to use contraception"
- Non-query-able: "Fertile males unwilling to use contraception"
- Post-eligibility: "Fertile males unwilling to use contraception"
- Condition: "brain metastases"
- Condition: "brain metastases"
- Temporal: "history"
- Procedure: "major surgery"
- Procedure: "intra-thoracic"
- Procedure: "intra -abdominal"
- Procedure: "intra -pelvic"
- Subjective_judgement: "major surgery"
- Value: "</= 4 weeks prior to starting study treatment"
- Reference_point: "starting study treatment"
- Undefined_semantics: "recovered from such therapy"
- Subjective_judgement: "recovered from such therapy"
- Negation: "not"
- Condition: "recovered from such therapy"
- Condition: "pulmonary embolism"
- Condition: "deep vein thrombosis"
- Qualifier: "untreated"
- Temporal: "within the past 6 months"
- Temporal: "history"
- Condition: "Impairment of gastrointestinal (GI) function"
- Condition: "GI disease"
- Qualifier: "may significantly alter the absorption of dovitinib"
- Undefined_semantics: "may significantly alter the absorption of dovitinib"
- Condition: "active malignancy"
- Temporal: "within the past 5 years"
- Condition: "cervical cancer in situ"
- Negation: "except"
- Condition: "in situ carcinoma of the bladder"
- Condition: "non-melanoma carcinoma of the skin"
- Procedure: "anticancer therapy"
- Procedure: "chemotherapy"
- Procedure: "immunotherapy"
- Procedure: "hormonal therapy"
- Drug: "monoclonal antibodies"
- Temporal: "</= 2 weeks prior to starting the study drug"
- Reference_point: "starting the study drug"
- Condition: "recovered from the side effects of such therapy"
- Condition: "Cirrhosis"
- Condition: "chronic active hepatitis"
- Condition: "chronic persistent hepatitis"
- Drug: "prasugrel"
- Drug: "isoniazid"
- Drug: "labetolol"
- Drug: "trovafloxacin"
- Drug: "tolcapone"
- Drug: "felbamate"
- Negation: "No"
- Negation: "No"
- Drug: "other investigational drugs"
- Procedure: "antineoplastic therapies"
- Undefined_semantics: "other investigational drugs"
- Condition: "impaired cardiac function"
- Qualifier: "clinically significant"
- Condition: "cardiac diseases"
- Subjective_judgement: "clinically significant"
- Undefined_semantics: "impaired cardiac function"